¿Cuál es la especie que se genera en el metabolismo de la ciclofosfamida y es responsable de ciertos efectos secundarios de este fármaco, como la cistitis hemorrágica?:
1. Benzoquinona.
2. Metildiazonio.
3. 1,1-Dimetilaziridinio.
4. Acroleína.

Respuesta correcta: 4. Acroleína.